Patient who are fluid responsive. Fluid responsiveness is defined as increase of > 10% in mean arterial pressure (MAP) after passive leg raising (PLR)

The above is a clinical trial inclusion criterion. Annotated with entity spans:
Patient who are [Condition: fluid responsive]. Fluid responsiveness is defined as increase of [Value: > 10%] in [Measurement: mean arterial pressure (MAP)] [Qualifier: after passive leg raising (PLR)]